Cerclage in situ

The above is a clinical trial exclusion criterion. Annotated with entity spans:
[Condition: Cerclage in situ]